Which genetic susceptibility loci are implicated in irritable bowel syndrome (IBS)?

Implicated genes included NCAM1, CADM2, PHF2/FAM120A, DOCK9, CKAP2/TPTE2P3 and BAG6.